Clinical trial inclusion criterion:
Age: 20-70 years old;

Annotated entities:
- Person: "Age"
- Value: "20-70 years old"